Clinical trial inclusion criterion:
(1)Completed MTHFR C677T gene polymorphism detection in run-in period or MTHFR C677T genotype already known in advance;

Annotated entities:
- Procedure: "gene polymorphism detection"
- Observation: "genotype already known"
- Qualifier: "MTHFR C677T"
- Qualifier: "MTHFR C677T"